El parámetro independiente del modelo de disolución, la eficiencia de solución, tiene dos limitaciones. Una de ellas es que el último punto experimental tiene carácter arbitrario ¿Cuál es la otra limitación?:
1. Debe disolverse   como mínimo el 50% de la dosis.
2. Debe disolverse   como mínimo el 60% de la dosis.
3. Debe disolverse   como mínimo el 75% de la dosis.
4. Debe disolverse   como mínimo el 80% de la dosis.
5. Debe disolverse   como mínimo el 90% de la dosis.

Respuesta correcta: 5. Debe disolverse   como mínimo el 90% de la dosis.